En la formación de complejos antígenoanticuerpo, no intervienen:
1. Interacciones electrostáticas.
2. Puentes de hidrógeno.
3. Interacciones hidrofóbicas.
4. Enlaces covalentes.

Respuesta correcta: 4. Enlaces covalentes.